Patients with major depressive disorder according to DSM-IV criteria that have lasted >8 weeks

The above is a clinical trial inclusion criterion. Annotated with entity spans:
Patients with [Condition: major depressive disorder] according to [Measurement: DSM-IV criteria] that have [Temporal: lasted >8 weeks]